Serum creatinine > 1.5mg/dl

The above is a clinical trial exclusion criterion. Annotated with entity spans:
[Measurement: Serum creatinine] [Value: > 1.5mg/dl]